Clinical trial exclusion criterion:
Serum creatinine > twice the upper limit of the normal range

Entity relations:
- Has_value("Serum creatinine", "> twice the upper limit of the normal range")